下列有關味覺訊息的神經傳導敘述，何者正確？
A. 來自舌前三分之二的味覺訊息，經由舌咽神經（glossopharyngeal nerve）傳至延腦
B. 來自舌後三分之一的味覺訊息，經由舌下神經（hypoglossal nerve）傳至延腦
C. 來自咽部（pharynx）的味覺訊息，經由迷走神經（vagus nerve）傳至延腦
D. 所有的味覺訊息傳至延腦之神經元，即將訊號直接投射至大腦皮質，中間不再停駐於任何腦區

正確答案：C. 來自咽部（pharynx）的味覺訊息，經由迷走神經（vagus nerve）傳至延腦